pregnant or breastfeeding women

The above is a clinical trial exclusion criterion. Annotated with entity spans:
[Condition: pregnant] or [Observation: breastfeeding] [Person: women]